Clinical trial exclusion criterion:
Clinical diagnosis of Type 1 diabetes, maturity onset diabetes of the young, secondary diabetes or diabetes insipidus.

Entity relations:
- OR("Type 1 diabetes", "diabetes insipidus", "maturity onset diabetes of the young", "secondary diabetes")